En eucariotas, la RNA polimerasa que transcribe ARNs ribosómicos pequeños es la:
1. II.
2. I.
3. IV.
4. III.
5. V.

Respuesta correcta: 4. III.